子宮輸卵管攝影（hysterosalpingography）是用來評估女性不孕症的一項檢查，下列檢查日期何者最好？
A. 月經週期第3天
B. 月經週期第8天
C. 月經週期第14天
D. 月經週期第21天

正確答案：B. 月經週期第8天